Clinical trial exclusion criterion:
History of an adverse reaction to Cortrosyn™ or similar test reagents

Entity relations:
- Has_qualifier("test reagents", "similar")
- Has_qualifier("adverse reaction", "Cortrosyn")
- AND("adverse reaction", "Cortrosyn")
- AND("adverse reaction", "test reagents")
- OR("Cortrosyn", "similar test reagents")